Clinical trial inclusion criteria:
Patients with diagnosis of multiple myeloma according to criteria of the International Myeloma Working Group
Patients in whom a LEN-DEX-based treatment regimen is indicated
Adult patients ≥ 19 years of age who are able to freely provide informed consent

Annotated entities:
- Condition: "multiple myeloma"
- Measurement: "criteria of the International Myeloma Working Group"
- Drug: "DEX"
- Drug: "LEN"
- Qualifier: "LEN-DEX-based"
- Procedure: "treatment regimen"
- Mood: "is indicated"
- Person: "Adult"
- Value: "≥ 19 years"
- Person: "age"
- Observation: "able to freely provide informed consent"